Participation in another clinical trial.

The above is a clinical trial exclusion criterion. Annotated with entity spans:
[Non-query-able: Participation in another clinical trial.]